Clinical trial inclusion criterion:
Stable pharmacological therapy during the last 4 weeks (with the exception of diuretics)

Annotated entities:
- Procedure: "pharmacological therapy"
- Qualifier: "Stable"
- Temporal: "during the last 4 weeks"
- Reference_point: "last 4 weeks"
- Drug: "diuretics"
- Negation: "with the exception of"